Clinical trial exclusion criterion:
Drug/alcohol abuse: Subjects with a known or suspected history of alcohol or drug abuse within the last 2 years.

Annotated entities:
- Drug: "alcohol abuse"
- Drug: "Drug abuse"
- Temporal: "history"
- Drug: "drug abuse"
- Drug: "alcohol abuse"
- Temporal: "within the last 2 years"